Clinical trial inclusion criterion:
Clinical diagnosis of Autism Spectrum Disorder

Entity relations:
- Has_qualifier("Autism Spectrum Disorder", "Clinical diagnosis")